Clinical trial exclusion criterion:
Acute disease at the time of enrolment.

Entity relations:
- Has_temporal("Acute disease", "at the time of enrolment")